Clinical trial exclusion criterion:
Patients with known or suspected right-to-left, bi-directional, or transient right-to-left cardiac shunts

Annotated entities:
- Condition: "transient right-to-left cardiac shunts"
- Condition: "bi-directional cardiac shunts"
- Condition: "right-to-left cardiac shunts"
- Mood: "suspected"
- Mood: "known"